下列何種細菌可作為微生物殺蟲劑，消滅病媒蚊之幼蟲，用以防治登革熱？
A. 比菲德氏菌（Bifidus）
B. 蘇力菌（Bacillus thuringiensis）
C. 乳酸桿菌（Lactobacillus acidophilus）
D. 大腸桿菌（Escherichia coli）

正確答案：B. 蘇力菌（Bacillus thuringiensis）